La hipersecreción bronquial en respuesta a una irritación bronquial continuada es el mecanismo patogénico observado en una de las siguientes entidades:
1. Enfisema pulmonar.
2. Bronquitis crónica.
3. Asma bronquial.
4. Fibrosis pulmonar.

Respuesta correcta: 2. Bronquitis crónica.